Lipopolysaccharide（LPS）是革蘭氏陰性細菌細胞壁的成分，會和白血球上的那個分子結合？
A. CD1
B. CD5
C. CD14
D. CD25

正確答案：C. CD14